Clinical trial inclusion criterion:
Good health condition, without clinically significant medical history (by participant or guardian, in case of minor)

Entity relations:
- Has_negation("medical history", "without")
- Has_qualifier("medical history", "clinically significant")